Adults older than 45 and children younger than 18 years

The above is a clinical trial exclusion criterion. Annotated with entity spans:
[Person: Adults] [Value: older than 45] and [Person: children] [Value: younger than 18 years]